Un compuesto que presenta un esqueleto heterocíclico aromático de cinco miembros con tres átomos de carbono y dos nitrógenos, estos últimos es posiciones 1 y 3, se denomina:
1. Pirrol.
2. Pirimidina.
3. Pirazol.
4. Pirazolidina.
5. Imidazol.

Respuesta correcta: 5. Imidazol.